Clinical trial exclusion criterion:
Lives in a nursing home (persons living in assisted or independent housing will not be excluded)

Annotated entities:
- Observation: "Lives in a nursing home"